Clinical trial exclusion criteria:
Glaucoma,
Ocular allergy
Autoimmune disease
Contact lens-wear during study
Current punctal plugging
Pregnant/lactating
Candidate for topical anti-inflammatory
Cicatricial meibomian gland dysfunction

Annotated entities:
- Condition: "Glaucoma"
- Condition: "Ocular allergy"
- Condition: "Autoimmune disease"
- Observation: "Contact lens-wear"
- Temporal: "during study"
- Temporal: "Current"
- Condition: "punctal plugging"
- Condition: "Pregnant"
- Condition: "lactating"
- Mood: "Candidate for"
- Drug: "topical anti-inflammatory"
- Qualifier: "Cicatricial"
- Condition: "meibomian gland dysfunction"